Clinical trial exclusion criterion:
Patients with a history of type I or type II diabetes or HbA1c greater than 6.5%.

Annotated entities:
- Condition: "type II diabetes"
- Condition: "type I diabetes"
- Measurement: "HbA1c"
- Value: "greater than 6.5%"
- Temporal: "history"